Male and female adolescent patients, aged 13 to 17 years, diagnosed with RLS based on the IRLSSG consensus criteria (Allen RP 2014) (Appendix 2).

The above is a clinical trial inclusion criterion. Annotated with entity spans:
[Person: Male] and [Person: female] [Person: adolescent] patients, [Person: aged] [Value: 13 to 17 years], diagnosed with [Condition: RLS] based on the [Measurement: IRLSSG consensus criteria] (Allen RP 2014) (Appendix 2).